Contraindications to etomidate (sepsis, primary or secondary adrenal insufficiency, porphyria)

The above is a clinical trial exclusion criterion. Annotated with entity spans:
[Condition: Contraindications] to [Drug: etomidate] ([Condition: sepsis], [Qualifier: primary] or [Qualifier: secondary] [Condition: adrenal insufficiency], [Condition: porphyria])